Clinical trial exclusion criterion:
significant unstable medical condition or life threatening disease with anticipated survival of less than 6 months;

Annotated entities:
- Condition: "medical condition"
- Qualifier: "unstable"
- Condition: "life threatening disease"
- Observation: "anticipated survival"
- Value: "less than 6 months"